下列何者不是內髂動脈（internal iliac artery）的分支？
A. 臍動脈（umbilical artery）
B. 正中薦動脈（median sacral）
C. 臀上動脈（superior gluteal artery）
D. 陰部動脈（pudenal artery）

正確答案：B. 正中薦動脈（median sacral）